Clinical trial inclusion criterion:
2. Have a finding of a mass lesion on ultrasound (BIRADS 0, 4 or 5) that is > 0.5 cm and < 2 cm in size.

Annotated entities:
- Condition: "mass lesion"
- Procedure: "ultrasound"
- Measurement: "BIRADS"
- Value: "0, 4 or 5"
- Value: "> 0.5 cm and < 2 cm"
- Measurement: "size"